Clinical trial exclusion criterion:
Known allergy to local anesthetics (7) Not scheduled for closed reduction with percutaneous pinning under general anesthesia

Annotated entities:
- Condition: "allergy"
- Drug: "local anesthetics"
- Negation: "Not"
- Mood: "scheduled for"
- Procedure: "closed reduction with percutaneous pinning"
- Procedure: "general anesthesia"